Clinical trial exclusion criterion:
Cardiomyopathy

Annotated entities:
- Condition: "Cardiomyopathy"